La medición más precisa de la temperatura corporal en un paciente inconsciente, debe obtenerse a nivel:
1. Bucal.
2. Axilar.
3. Es indiferente.
4. Rectal.
5. Inguinal.

Respuesta correcta: 4. Rectal.